Which disease is linked to mutations within BRAG1?

Mutations in BRAG1 have been identified in families with X-linked intellectual disability (XLID).